有關聲波在耳內的傳導順序，下列何者最為適當？
A. 鼓膜（tympanic membrane）→鎚骨（malleus）→砧骨（incus）→鐙骨（stapes）→圓窗（round window）→卵圓窗（oval window）
B. 鼓膜（tympanic membrane）→鐙骨（stapes）→砧骨（incus）→鎚骨（malleus）→卵
C. 鼓膜（tympanic membrane）→鐙骨（stapes）→砧骨（incus）→鎚骨（malleus）→圓窗（round window）→卵圓窗（oval window）
D. 鼓膜（tympanic membrane）→鎚骨（malleus）→砧骨（incus）→鐙骨（stapes）→卵圓窗（oval window）→圓窗（round window）

正確答案：D. 鼓膜（tympanic membrane）→鎚骨（malleus）→砧骨（incus）→鐙骨（stapes）→卵圓窗（oval window）→圓窗（round window）